Clinical trial exclusion criterion:
Subjects who lost >200 mL during a single apheresis or who lost red blood cells on more than one occasion during apheresis within the previous 60 days.

Entity relations:
- Has_value("lost red blood cells", ">200 mL")
- Has_multiplier("apheresis", "single")
- AND("apheresis", "lost red blood cells")
- Has_index("within the previous 60 days", "the previous 60 days")
- Has_multiplier("apheresis", "more than one occasion")
- Has_temporal("apheresis", "within the previous 60 days")
- OR("apheresis", "apheresis")